What is caused by bi-allelic loss-of-function variants in IPO8?

Importin, a member of the importin-β protein family, is a protein that translocates cargo molecules, proteins, and ribonucleoprotein complexes into the nucleus in RanGTP-dependent manner. Bi-allelic loss-of-function variants in IPO8 cause a syndromic form of thoracic aortic aneurysm.